四種過敏免疫反應（hypersensitivity）中，在接觸引起反應的抗原後，那一型式需要最久時間才出現症狀？
A. 第一型
B. 第二型
C. 第三型
D. 第四型

正確答案：D. 第四型